下列何者不包括在精索內？
A. 輸精管
B. 睪丸動脈
C. 交感神經纖維
D. 髂腹股溝神經

正確答案：D. 髂腹股溝神經